Significant autoimmune disease including but not limited to immune cytopenias, rheumatoid arthritis, systemic lupus erythematosus, other connective tissue disorders, vasculitis, inflammatory bowel disease, severe psoriasis

The above is a clinical trial exclusion criterion. Annotated with entity spans:
Significant [Condition: autoimmune disease] including but not limited to [Condition: immune cytopenias,] [Condition: rheumatoid arthritis,] [Condition: systemic lupus erythematosus], other [Condition: connective tissue disorders], [Condition: vasculitis], [Condition: inflammatory bowel disease], [Qualifier: severe] [Condition: psoriasis]